Clinical trial exclusion criteria:
Central + mixed apneas > 25% of the total apnea-hypopnea index (AHI)
Any anatomical finding that would compromise the performance of upper airway stimulation, such as the presence of complete concentric collapse of the soft palate
Any condition or procedure that has compromised neurological control of the upper airway
Patients who are unable or do not have the necessary assistance to operate the patient remote
Patients who are pregnant or plan to become pregnant
Patients who will require magnetic resonance imaging (MRI)
Patients with an implantable device that may be susceptible to unintended interaction with the Inspire system.
Body Mass Index (BMI) of > 32
Any chronic medical illness or condition that contraindicates a surgical procedure under general anesthesia, as judged by the clinical study Investigator
Has a terminal illness with life expectancy < 12 months
Active psychiatric disease (psychotic illness, major depression, or acute anxiety attacks) which prevents subject compliance with the requirements of the investigational study testing
Any other reason the investigator deems subject is unfit for participation in the study

Annotated entities:
- Condition: "mixed apneas"
- Condition: "Central apneas"
- Value: "> 25%"
- Measurement: "total apnea-hypopnea index"
- Measurement: "AHI"
- Non-query-able: "Any anatomical finding that would compromise the performance of upper airway stimulation, such as the presence of complete concentric collapse of the soft palate"
- Non-query-able: "Any condition or procedure that has compromised neurological control of the upper airway"
- Non-query-able: "Patients who are unable or do not have the necessary assistance to operate the patient remote"
- Pregnancy_considerations: "Patients who are pregnant or plan to become pregnant"
- Procedure: "magnetic resonance imaging"
- Procedure: "MRI"
- Non-query-able: "Patients with an implantable device that may be susceptible to unintended interaction with the Inspire system"
- Measurement: "Body Mass Index"
- Measurement: "BMI"
- Value: "> 32"
- Condition: "contraindicates"
- Procedure: "surgical procedure"
- Procedure: "general anesthesia"
- Observation: "life expectancy"
- Value: "< 12 months"
- Condition: "psychiatric disease"
- Condition: "psychotic illness"
- Condition: "major depression"
- Condition: "acute anxiety attacks"
- Non-query-able: "Any other reason the investigator deems subject is unfit for participation in the study"